Current severe heart failure (New York Heart Association class IV). Subjects will also be excluded if they have a known ejection fraction of <30% or if they have an implantable cardioverter defibrillator (ICD).

The above is a clinical trial exclusion criterion. Annotated with entity spans:
Current [Qualifier: severe] [Condition: heart failure] ([Measurement: New York Heart Association] [Value: class IV]). Subjects will also be excluded if they have a known [Measurement: ejection fraction] of [Value: <30%] or if they have an [Device: implantable cardioverter defibrillator (ICD)].